Clinical trial exclusion criterion:
Any major psychiatric disorder, such as severe depression, severe anxiety disorder, psychosis, schizophrenia, other major psychiatric disorders, or seizures. History of mild depression or anxiety disorder that are well controlled are not exclusion criteria.

Annotated entities:
- Condition: "major psychiatric disorder"
- Qualifier: "severe"
- Condition: "depression"
- Qualifier: "severe"
- Condition: "anxiety disorder"
- Condition: "psychosis"
- Condition: "schizophrenia"
- Condition: "major psychiatric disorders"
- Qualifier: "other"
- Condition: "seizures"
- Qualifier: "mild"
- Condition: "depression"
- Condition: "anxiety disorder"
- Negation: "not"
- Qualifier: "well controlled"